胡先生，80 歲，與太太同住，有三男一女。五個月前發生下背痛，漸感下肢無力，走路困難，急診發現第四胸椎病理性骨折，導致脊髓壓迫，入院檢查為胃腺癌併肝、肺和脊椎轉移，手術後再接受化學治療及放射治療。因症狀持續惡化，在家人要求下照會並轉入安寧病房。病情方面，病人只知道神經壓迫引起下肢不適，不知是癌症末期，家人接受病情但擔心病人得知後會無法承受。下列有關病情告知的敘述，何者錯誤？
A. 只有當病人表示不希望知道病情或尚無準備時才暫不告知
B. 遵照家屬的意見，擔心病人無法承受而不告知
C. 讓家屬了解在互相隱瞞病情的情況下，病人會漸被孤立而失去自主權
D. 讓家屬了解無論如何地隱瞞病情，病人終究會知道

正確答案：B. 遵照家屬的意見，擔心病人無法承受而不告知